Clinical trial exclusion criterion:
BMI >40 Kg/ mm

Annotated entities:
- Observation: "BMI"
- Value: ">40 Kg/ mm"